Clinical trial inclusion criterion:
Subjects undergoing a single level lumbar decompression and fusion

Entity relations:
- Has_qualifier("lumbar decompression", "single level")
- Has_qualifier("lumbar fusion", "single level")